Clinical trial exclusion criterion:
1. Subject is a post-menopausal woman, defined as either; six (6) months or more (immediately prior to screening visit) without a menstrual period, or prior hysterectomy and/or oophorectomy

Entity relations:
- Has_negation("menstrual period", "without")
- AND("six (6) months or more", "menstrual period")
- Has_temporal("six (6) months or more", "immediately prior to screening visit")
- Has_temporal("hysterectomy", "prior")
- OR("menstrual period", "oophorectomy", "hysterectomy")